Clinical trial exclusion criterion:
renal insufficiency (calculated glomerular filtration rate under 60 ml/min/1.73 m2 according to Cockcroft-Gault scale )

Entity relations:
- Has_value("calculated glomerular filtration rate", "under 60 ml/min/1.73 m2")
- Has_qualifier("calculated glomerular filtration rate", "Cockcroft-Gault scale")